20-70 yrs of age

The above is a clinical trial inclusion criterion. Annotated with entity spans:
[Value: 20-70 yrs] of [Person: age]